Clinical trial inclusion criterion:
Monitoring of intracranial temperature and pressure by intraparenchymal sensor (Sophysa®)

Annotated entities:
- Measurement: "intracranial temperature"
- Measurement: "intracranial pressure"
- Device: "intraparenchymal sensor"
- Device: "Sophysa®"